Clinical trial inclusion criterion:
Simultaneous participation in another interventional clinical trial (drugs or medical devices studies)

Annotated entities:
- Competing_trial: "Simultaneous participation in another interventional clinical trial (drugs or medical devices studies)"